Clinical trial inclusion criteria:
older than 18 years (of both sexes)
diagnosed with stable chronic heart failure NYHA class II-III
ejection fraction < 40 % as assessed by 2D echocardiography
who have been optimized on Guideline Directed treatment for heart failure for at least a month prior to enrolling.

Annotated entities:
- Person: "years"
- Value: "older than 18"
- Person: "both sexes"
- Qualifier: "stable"
- Condition: "chronic heart failure"
- Measurement: "NYHA class"
- Value: "II-III"
- Measurement: "ejection fraction"
- Value: "< 40 %"
- Procedure: "2D echocardiography"
- Non-representable: "who have been optimized on Guideline Directed treatment for heart failure for at least a month prior to enrolling."